Prior anti-epidermal growth factor receptor (EGFr) antibody therapy (e.g., panitumumab or cetuximab) or treatment with small molecule EGFr inhibitors (e.g., gefitinib, erlotinib, lapatinib).

The above is a clinical trial exclusion criterion. Annotated with entity spans:
Prior [Procedure: anti-epidermal growth factor receptor] ([Procedure: EGFr]) antibody therapy (e.g., [Drug: panitumumab] or [Drug: cetuximab]) or [Procedure: treatment with small molecule EGFr inhibitors] (e.g., [Drug: gefitinib], [Drug: erlotinib], [Drug: lapatinib]).